Lack of appetite that results in significant unintentional weight loss as determined by the study physician in the last three months

The above is a clinical trial exclusion criterion. Annotated with entity spans:
[Condition: Lack of appetite] that results in [Qualifier: significant] [Condition: unintentional weight loss] [Qualifier: as determined by the study physician] [Temporal: in the last three months]